¿Con cuál de los siguientes trastornos presenta una mayor comorbilidad la enuresis nocturna?:
1. Pesadillas.
2. Trastorno por déficit de atención con hiperactividad.
3. Insomnio.
4. Bruxismo nocturno.
5. Terrores nocturnos.

Respuesta correcta: 5. Terrores nocturnos.